Clinical trial exclusion criterion:
Known allergies to any of the study medications by participant self-report

Annotated entities:
- Condition: "allergies"
- Non-query-able: "Known allergies to any of the study medications by participant self-report"